25歲頭部外傷男性病人，至急診時昏迷指數（Glasgow Coma Scale, GCS）3分，實施心肺復甦術並放置氣管內管之後，此時使用潮氣末二氧化碳偵測器（End-tidal CO2 detector），下列敘述何者最不適當？
A. 潮氣末二氧化碳偵測器可用來監測心肺復甦術品質
B. 潮氣末二氧化碳偵測器可用來確認氣管內管位置
C. 潮氣末二氧化碳值 12.5 mmHg代表血流偏低且氣管內管放置到食道
D. 當潮氣末二氧化碳值突增至40 mmHg時，代表病人較易恢復自發性循環（return of

正確答案：C. 潮氣末二氧化碳值 12.5 mmHg代表血流偏低且氣管內管放置到食道